下列何種藥物是經由抑制 muscarinic receptor 而達到治療 irritable bowel syndrome 的作用？
A. Bethanechol
B. Pirenzepine
C. Tropicamide
D. Clidinium

正確答案：D. Clidinium